Patients that are known to be positive for Human Immunodeficiency Virus (HIV) (HIV 1/2 antibodies), active Hepatitis B (HBsAg reactive), or Hepatitis C (HCV RNA [qualitative] is detected); patients with negative Hepatitis C antibody testing may not need RNA testing.

The above is a clinical trial exclusion criterion. Annotated with entity spans:
Patients that are known to be [Value: positive] for [Measurement: Human Immunodeficiency Virus (HIV)] ([Qualifier: HIV 1/2 antibodies]), [Condition: active Hepatitis B] ([Measurement: HBsAg] [Value: reactive]), or [Condition: Hepatitis C] ([Measurement: HCV RNA [qualitative]] is [Value: detected]); [Non-query-able: patients with negative Hepatitis C antibody testing may not need RNA testing].